Clinical trial inclusion criterion:
Aged 18 years or older

Annotated entities:
- Person: "Aged"
- Value: "18 years or older"